Clinical trial exclusion criterion:
Medical history of cardiovascular disease, malignant cancer, diabetes or kidney disease

Annotated entities:
- Condition: "cardiovascular disease"
- Condition: "malignant cancer"
- Condition: "diabetes"
- Condition: "kidney disease"